心臟外科手術時，常經由下列何構造進行暫時性大動脈結紮？
A. 動脈韌帶（ligamentum arteriosum）
B. 心包膜橫竇（transverse pericardial sinus）
C. 冠狀竇（coronary sinus）
D. 終末溝（sulcus terminalis）

正確答案：B. 心包膜橫竇（transverse pericardial sinus）